Clinical trial exclusion criterion:
Abdominal ultrasound display the contractibility of gallbladder is poor.

Annotated entities:
- Procedure: "Abdominal ultrasound"
- Measurement: "contractibility of gallbladder"
- Value: "poor"